Hyper- or hypothyroidism (subjects requiring medication to maintain TSH levels in the normal range are eligible if all other inclusion/exclusion criteria are met)

The above is a clinical trial exclusion criterion. Annotated with entity spans:
[Condition: Hyper]- or [Condition: hypothyroidism] ([Non-query-able: subjects requiring medication to maintain TSH levels in the normal range are eligible if all other inclusion/exclusion criteria are met])